56 歲患有高血壓的貿易公司經理突發左手、左腳癱瘓，並立即不省人事，下列那種情況最有可能？
A. Right thalamic hemorrhage
B. Right middle cerebral artery occlusion
C. Right vertebral artery occlusion
D. Right internal capsule infarct

正確答案：A. Right thalamic hemorrhage